Age > 18 years old

The above is a clinical trial inclusion criterion. Annotated with entity spans:
[Person: Age] [Value: > 18 years old]